Clinical trial inclusion criterion:
Histologically confirmed PD-L1 status defined NSCLC. Biopsy must be within 70 days of first treatment with pembrolizumab.

Annotated entities:
- Condition: "NSCLC"
- Qualifier: "PD-L1 status"
- Procedure: "Biopsy"
- Temporal: "within 70 days of first treatment"
- Reference_point: "first treatment with pembrolizumab"
- Drug: "pembrolizumab"